Clinical trial exclusion criteria:
Patients with allergies or contraindications to study medications

Annotated entities:
- Condition: "allergies"
- Condition: "contraindications"
- Drug: "study medications"